Clinical trial exclusion criterion:
Congenital heart disease

Annotated entities:
- Condition: "Congenital heart disease"